Clinical trial exclusion criterion:
Non diabetic nephropathy (confirmed by biopsy).

Annotated entities:
- Condition: "Non diabetic nephropathy"
- Qualifier: "confirmed by biopsy"
- Procedure: "biopsy"